systemic conditions associated with chronic pain

The above is a clinical trial exclusion criterion. Annotated with entity spans:
[Condition: systemic conditions] [Qualifier: associated with chronic pain]